Los delirios son síntomas característicos de la esquizofrenia que:
1. Incluyen alteraciones de la sensopercepción.
2. Implican alucinaciones psicomotoras.
3. Representan una creencia falsa basada en una interpretación errónea de la realidad por parte del paciente.
4. Consisten en una incapacidad del individuo para adaptarse a las normas sociales.
5. Se equiparan a las ilusiones.

Respuesta correcta: 3. Representan una creencia falsa basada en una interpretación errónea de la realidad por parte del paciente.